Patients who have taken more than one anti-TNFa agent

The above is a clinical trial inclusion criterion. Annotated with entity spans:
Patients who have taken [Multiplier: more than one] [Drug: anti-TNFa agent]